Clinical trial exclusion criterion:
patient refusal

Annotated entities:
- Observation: "patient refusal"